Clinical trial exclusion criterion:
Patients under 18 years or inability to consent

Annotated entities:
- Person: "years"
- Value: "under 18"
- Condition: "inability to consent"
- Informed_consent: "inability to consent"